Investigational drugs/agents within 14 days of first dose of 852A

The above is a clinical trial exclusion criterion. Annotated with entity spans:
[Drug: Investigational drugs/agents] [Temporal: within 14 days of first dose] of [Drug: 852A]